Clinical trial inclusion criterion:
Signed informed consent of study participation

Annotated entities:
- Post-eligibility: "Signed informed consent of study participation"